心導管檢查時，在左心室注射對比劑（contrast medium）後攝影無法評估以下那個項目？
A. 主動脈閉鎖不全（aortic regurgitation）的嚴重度
B. 二尖瓣閉鎖不全（mitral regurgitation）的嚴重度
C. 左心室射出分率（left ventricular ejection fraction）
D. 左心室舒張末期容積（left ventricular end-diastolic volume）

正確答案：A. 主動脈閉鎖不全（aortic regurgitation）的嚴重度